Clinical trial inclusion criteria:
Phase 1 Specific Patient at least 18yrs of age with histologically confirmed CLL/SLL or B-cell Non-Hodgkin lymphoma (DLBCL, FL, MCL, MZL, lymphoplasmacytic lymphoma).
Phase 2a Inclusion
Histological evidence: FL Grade 1-3A/iNHL, with relapsed or refractory disease (iNHL includes LPL/WM, MZL); aNHL, defined as DLBCL, FL Grade 3B, MCL, and transformed NHL with relapsed disease; CLL/SLL, PTCL, or CTCL (with MF/SS) with relapsed or refractory.
Received BCR and/or BCL2 inhibitors were intolerant or had relapsed/refractory disease afterwards.
Prior treatment for lymphoid malignancy for progressive /refractory disease
≥ 1 prior regimen (min 2 cycles) with antibody conjugate, cytotoxic chemotherapy, or TKI alone or in combination.
Measureable disease defined as: ≥ 1 lesion ≥ 1.5 cm single dimension via CT, CT/PET with nodal or mass lesions; Quantifiable circulating tumor cells; or for Waldenström's macroglobulinemia presence of IgM l > 2X ULN; For CTCL: mSWAT > 0
Ability to provide diagnostic reports
General Inclusion
ECOG Score of 0 or 1.
Hematologic ANC > 1000/uL and platelet > 75,000/uL,
Serum creatinine of < 1.5 ULN or calculated CrCl of > 50 mL/min
Bilirubin < 20.0mg/dL (if Gilberts then < 2.5 mg/dL) and AST/AST < 2.5 ULN

Annotated entities:
- Condition: "CLL"
- Condition: "SLL"
- Condition: "B-cell Non-Hodgkin lymphoma"
- Condition: "DLBCL"
- Condition: "FL"
- Condition: "MCL"
- Condition: "MZL"
- Condition: "lymphoplasmacytic lymphoma"
- Value: "at least 18yrs"
- Person: "age"
- Procedure: "histologically"
- Value: "confirmed"
- Parsing_Error: "Phase 2a Inclusion"
- Procedure: "Histological"
- Condition: "FL"
- Measurement: "Grade"
- Value: "1-3A"
- Condition: "iNHL"
- Condition: "refractory disease"
- Condition: "relapsed disease"
- Condition: "iNHL"
- Condition: "LPL"
- Condition: "WM"
- Condition: "MZL"
- Condition: "aNHL"
- Condition: "DLBCL"
- Condition: "FL"
- Measurement: "Grade"
- Value: "3B"
- Condition: "MCL"
- Condition: "transformed NHL"
- Condition: "relapsed disease"
- Condition: "CLL"
- Condition: "SLL"
- Condition: "PTCL"
- Condition: "CTCL"
- Condition: "MF"
- Condition: "SS"
- Drug: "BCL2 inhibitors"
- Drug: "BCR inhibitors"
- Condition: "intolerant"
- Condition: "relapsed"
- Condition: "refractory disease"
- Temporal: "afterwards"
- Temporal: "Prior"
- Procedure: "treatment"
- Condition: "lymphoid malignancy"
- Condition: "refractory disease"
- Condition: "progressive disease"
- Drug: "antibody conjugate"
- Procedure: "cytotoxic chemotherapy"
- Drug: "TKI"
- Multiplier: "≥ 1 prior regimen"
- Multiplier: "min 2 cycles"
- Condition: "Measureable disease"
- Multiplier: "≥ 1 lesion"
- Measurement: "≥ 1.5 cm single dimension"
- Value: "≥ 1.5 cm"
- Procedure: "CT"
- Procedure: "CT/PET"
- Condition: "mass lesions"
- Condition: "nodal lesions"
- Condition: "circulating tumor cells"
- Condition: "Waldenström's macroglobulinemia"
- Measurement: "IgM l"
- Value: "> 2X ULN"
- Condition: "CTCL"
- Measurement: "mSWAT"
- Value: "> 0"
- Non-query-able: "Ability to provide diagnostic reports"
- Parsing_Error: "General Inclusion"
- Measurement: "ECOG Score"
- Value: "0 or 1"
- Measurement: "Hematologic ANC"
- Value: "> 1000/uL"
- Measurement: "platelet"
- Value: "> 75,000/uL"
- Measurement: "Serum creatinine"
- Value: "< 1.5 ULN"
- Measurement: "calculated CrCl"
- Value: "> 50 mL/min"
- Measurement: "Bilirubin"
- Value: "< 20.0mg/dL"
- Condition: "Gilberts"
- Value: "< 2.5 mg/dL"
- Measurement: "AST/AST"
- Value: "< 2.5 ULN"